Clinical trial inclusion criterion:
Cholecystectomy or bile duct resection

Entity relations:
- OR("Cholecystectomy", "bile duct resection")